What are the characteristics of the "Universal Proteomics Standard 2" (UPS2)?

The UPS2 proteomic dynamic range standard was introduced by the Association of Biomolecular Resource Facilities Proteomics Standards Research Group in 2006 and it has a dynamic range of 5 orders of magnitude.